下列何者經由抑制vitamin K epoxide reductase，而減少凝血因子製造？
A. heparin
B. warfarin
C. tPA（tissue plasminogen activator）
D. melagartran

正確答案：B. warfarin